服用藥物前的精神分裂患者常出現下列那一種現象？
A. 敏捷行為增加
B. 精細動作（fine motor）增加
C. 眨眼速率增加
D. 不正常肌肉張力減少

正確答案：C. 眨眼速率增加